下列何種蚊種之幼蟲，曾經被用做防治登革熱病媒蚊之天敵（predator）？
A. 安邦巨蚊（Toxorhynchites amboinensis）
B. 熱帶家蚊（Culex quinquefasciatus）
C. 環紋家蚊（Culex annulus）
D. 矮小瘧蚊（Anopheles minimus）

正確答案：A. 安邦巨蚊（Toxorhynchites amboinensis）